腦部原發性淋巴瘤（primary central nervous system lymphoma）的治療方式中，下列何者最不適當？
A. 外科手術
B. 類固醇
C. 放射治療
D. 化學療法

正確答案：A. 外科手術